在快速生長的婦癌中，其癌細胞由一個變成兩個的時間（doubling time）最短而化療最見成效的是：
A. ovarian serous cystadenocarcinoma
B. choriocarcinoma
C. uterine sarcoma
D. squamous cell carcinoma of cervix

正確答案：B. choriocarcinoma